What is caused by SCUBE2 loss-of-function?

Loss-of-function mutations of SCUBE2 cause loss of osteoblast differentiation, bone formation and endochondral bone formation. Loss of hedgehog activity leads to premature differentiation of mesenchymal stem cells and induces apoptosis of chondrocyte precursor cells.